¿Cuál es la arritmia que con mayor frecuencia desencadena muerte súbita en un contexto de cardiopatía isquémica aguda?
1. Extrasístole.
2. Taquicardia ventricular.
3. Fibrilación ventricular.
4. Fibrilación auricular.
5. Bloqueo aurículoventricular.

Respuesta correcta: 3. Fibrilación ventricular.